Present alcoholism or drug abuse or use of medications that could interfere with the treatment including bronchodilators, quinolone antibiotics, monoamine oxidase inhibitors, anxiolytics, ranitidine, corticosteroids, growth hormone, antihypertensives.

The above is a clinical trial exclusion criterion. Annotated with entity spans:
Present [Condition: alcoholism] or [Condition: drug abuse] or use of [Drug: medications that could interfere with the treatment] including [Drug: bronchodilators], [Drug: quinolone antibiotics], [Drug: monoamine oxidase inhibitors], [Drug: anxiolytics], [Drug: ranitidine], [Drug: corticosteroids], [Drug: growth hormone], [Drug: antihypertensives].